一位 46 歲女性病人，被家人發現盜汗、神智不清及抽搐而送進急診處。病人並無高血壓或頭部外傷史，也無抽筋或昏迷的病史，理學檢查也無局部或單側神經系統的異常。在急診處有關的生化學檢查，最主要必須包括：
A. Ammonia
B. BUN
C. 鈣離子濃度
D. 血糖值

正確答案：D. 血糖值